Clinical trial exclusion criterion:
Patients with chronic infection with Hepatitis B virus (HBV) and / or active infection with Hepatitis C virus (positive PCR result) at the time of transplant.

Annotated entities:
- Condition: "Hepatitis B virus (HBV)"
- Condition: "Hepatitis C virus"
- Procedure: "PCR result"
- Value: "positive"
- Qualifier: "chronic"
- Qualifier: "active"
- Temporal: "at the time of transplant"